Baseline 6-minutes walking distance 150m-550m.

The above is a clinical trial inclusion criterion. Annotated with entity spans:
[Temporal: Baseline] [Measurement: 6-minutes walking distance] [Value: 150m-550m].